Patient have contraindication to chemotherapy(eg.uncontrolled coronarism and heart failure; History of myocardial infarction within the past 6 months, Chronic obstructive pulmonary, uncontrolled epileptic attack and other disease that investigator consider it unsuitable for the chemotherapy)

The above is a clinical trial exclusion criterion. Annotated with entity spans:
Patient have [Condition: contraindication] to [Procedure: chemotherapy](eg.[Qualifier: uncontrolled] [Condition: coronarism] and [Condition: heart failure]; [Temporal: History] of [Condition: myocardial infarction] [Temporal: within the past 6 months], [Condition: Chronic obstructive pulmonary], [Qualifier: uncontrolled] [Condition: epileptic attack] and [Qualifier: other] [Condition: disease] that investigator consider it [Condition: unsuitable for the chemotherapy])